下列那一種裝具對頭頸椎活動度的限制效果最差？
A. 費城支架（Philadelphia collar）
B. 軟式頸圈（soft collar）
C. 四柱式支架（4-poster brace）
D. 暈輪式背心（halo vest）

正確答案：B. 軟式頸圈（soft collar）